下列何種病人發生缺鐵性貧血的機會最小？
A. gastrectomy
B. menorrhagia
C. paroxysmal nocturnal hemogblobinuria
D. thalassemia

正確答案：D. thalassemia